Clinical trial exclusion criteria:
Subject are pregnant
Subject is unable to perform tasks associated with study

Annotated entities:
- Condition: "pregnant"
- Post-eligibility: "Subject is unable to perform tasks associated with study"